Clinical trial exclusion criterion:
Use of immunoglobulin in the past 12 months before the study vaccination;

Annotated entities:
- Drug: "immunoglobulin"
- Temporal: "in the past 12 months before the study vaccination"
- Reference_point: "the study vaccination"